Clinically significant laboratory abnormalities.

The above is a clinical trial exclusion criterion. Annotated with entity spans:
[Qualifier: Clinically significant] [Condition: laboratory abnormalities].